¿Cómo se denomina la contracción muscular que se realiza con cambio de longitud, pero sin cambio de tensión?:
1. Normotónica.
2. Isotónica.
3. Isométrica.
4. Hipotónica.

Respuesta correcta: 2. Isotónica.